以下有關異位性皮膚炎（atopic dermatitis）之敘述，何者正確？
A. 與家族遺傳無關
B. 發生異位性皮膚炎的嬰兒將來有高達 90%以上的機會罹患氣喘
C. 較易發生刺激性接觸性皮膚炎（irritant contact dermatitis）
D. 較易發生過敏性接觸性皮膚炎（allergic contact dermatitis）

正確答案：C. 較易發生刺激性接觸性皮膚炎（irritant contact dermatitis）